Psychiatric illness

The above is a clinical trial exclusion criterion. Annotated with entity spans:
[Condition: Psychiatric illness]